Clinical trial inclusion criteria:
37 weeks gestation or greater
Living, singleton fetus
No major fetal malformations
Cephalic presentation
No prior uterine scar
Intact fetal membranes
Qualifies for prostaglandin administration according to current Parkland protocol
Have a cervical dilation of 2 centimeters or less, measured at the level of the internal os
Have an indication for induction or attempted induction of labor according to Parkland protocol

Annotated entities:
- Condition: "gestation"
- Value: "37 weeks greater"
- Condition: "singleton fetus"
- Qualifier: "Living"
- Condition: "major fetal malformations"
- Negation: "No"
- Condition: "Cephalic presentation"
- Negation: "No"
- Condition: "uterine scar"
- Condition: "fetal membranes"
- Qualifier: "Intact"
- Procedure: "prostaglandin administration"
- Procedure: "Parkland protocol"
- Condition: "cervical dilation"
- Multiplier: "2 centimeters or less"
- Qualifier: "internal os"
- Condition: "indication"
- Procedure: "induction of labor"
- Qualifier: "attempted"
- Procedure: "Parkland protocol"
- Procedure: "induction"